¿Cuál de los siguientes componentes forma parte del programa de intervención breve de Foa et al. (1995) para el tratamiento de víctimas de agresiones sexuales?:
1. Terapia de Aceptación y Compromiso.
2. Entrenamiento en inoculación del estrés.
3. Reestructuración cognitivo sobre las creencias irracionales acerca de la peligrosidad del mundo y la carencia de control sobre los hechos.
4. Resolución de problemas.

Respuesta correcta: 3. Reestructuración cognitivo sobre las creencias irracionales acerca de la peligrosidad del mundo y la carencia de control sobre los hechos.